Clinical trial inclusion criteria:
the patients undergoing ascending, arch and/or proximal descending aorta surgery with cardiopulmonary bypass
20 - 100 yrs old

Annotated entities:
- Procedure: "ascending aorta surgery"
- Procedure: "arch aorta surgery"
- Procedure: "proximal descending aorta surgery"
- Procedure: "cardiopulmonary bypass"
- Person: "old"
- Value: "20 - 100 yrs"